Patients of both sexes aged 35 to 65 years

The above is a clinical trial inclusion criterion. Annotated with entity spans:
Patients of [Value: both] [Person: sexes] [Person: aged] [Value: 35 to 65 years]